List the continent of origin for the brown marmorated stinkbug(Halyomorpha halys)

The brown marmorated stinkbug (Halyomorpha halys) is native to Asia